Clinical trial exclusion criterion:
Serum creatinine > 1.5mg/dl

Annotated entities:
- Measurement: "Serum creatinine"
- Value: "> 1.5mg/dl"